目前腦下垂體腫瘤，那一組病人以藥物治療使用最常見：① 無功能性瘤 ② 泌乳素瘤 ③ 生長素瘤 ④ 甲促素瘤
A. ① ②
B. ② ③
C. ③ ④
D. ① ④

正確答案：B. ② ③